快速、淺短呼吸指數（rapid-shallow-breathing index）為何時，病患成功脫離呼吸器之機會較高？
A. ＜105
B. ＜140
C. ＜210
D. ＜250

正確答案：A. ＜105